Clinical trial exclusion criterion:
Subjects who are currently treated with sildenafil for PAH or taking sildenafil or tadalafil.

Entity relations:
- Has_temporal("sildenafil", "currently")
- Has_temporal("PAH", "currently")
- OR("sildenafil", "tadalafil", "sildenafil")